Clinical trial inclusion criteria:
Patients older than 18 years
Ischemic symptoms or evidence of myocardial ischemia (inducible or spontaneous) in the presence of >50% de novo stenosis located in native coronary vessels

Annotated entities:
- Person: "years"
- Value: "older than 18"
- Condition: "Ischemic symptoms"
- Mood: "evidence"
- Condition: "myocardial ischemia"
- Qualifier: "inducible"
- Qualifier: "spontaneous"
- Value: ">50%"
- Qualifier: "de novo"
- Measurement: "stenosis"
- Condition: "stenosis"
- Qualifier: "native coronary vessels"